Clinical trial exclusion criterion:
Patients for whom endoscopic techniques are contraindicated

Annotated entities:
- Condition: "contraindicated"
- Procedure: "endoscopic techniques"